Sleep apnoea

The above is a clinical trial exclusion criterion. Annotated with entity spans:
[Condition: Sleep apnoea]